Severe liver and renal dysfunction

The above is a clinical trial exclusion criterion. Annotated with entity spans:
[Qualifier: Severe] [Condition: liver] and [Condition: renal dysfunction]